Normal range for their height and weight. Weight and height measurements should fall within the percentile range 3-97% of normal values for age according to Danish growth charts.

The above is a clinical trial inclusion criterion. Annotated with entity spans:
[Value: Normal range] for their [Measurement: height] and [Measurement: weight]. [Measurement: Weight] and [Measurement: height] measurements should fall [Value: within the percentile range 3-97%] of normal values for age according to Danish growth charts.